Decreased response to levodopa combination drugs

The above is a clinical trial inclusion criterion. Annotated with entity spans:
[Condition: Decreased response] to l[Drug: evodopa combination drugs]